下列治療血脂異常（dyslipidemia）的藥物，何者是透過抑制腸道NPC1L1 sterol transporter，而減少膽固醇（cholesterol）的吸收？
A. cholestyramine
B. gemfibrozil
C. ezetimibe
D. simvastatin

正確答案：C. ezetimibe